Clinical trial exclusion criterion:
The use of butalbital in any form within 4 weeks of beginning the Preliminary Screening Period (P1) through the end of the participant's study involvement is exclusionary.

Entity relations:
- Has_temporal("butalbital", "within 4 weeks of beginning the Preliminary Screening Period (P1)")